History of cardiovascular disease;

The above is a clinical trial exclusion criterion. Annotated with entity spans:
[Temporal: History] of [Condition: cardiovascular disease];